Clinical trial exclusion criterion:
Any medical condition requiring, or likely to require chronic systemic administration of steroids, during the course of the study

Annotated entities:
- Drug: "systemic steroids"
- Qualifier: "chronic"
- Temporal: "during the course of the study"
- Reference_point: "course of the study"